What alternate indication has Vanoxerine been repositioned for?

Vanoxerine has been in clinical trials for Parkinsonism, depression and cocaine addiction and can potential treat atrial fibrillation